Clinical trial inclusion criterion:
Provides written informed consent

Annotated entities:
- Observation: "written informed consent"